Chronic infectious disease, system or organ disorder or other medical condition that would place patient at undue risk by study participation

The above is a clinical trial exclusion criterion. Annotated with entity spans:
[Subjective_judgement: Chronic infectious disease, system or organ disorder or other medical condition that would place patient at undue risk by study participation]